En espectrometría de masas, el patrón de fragmentación más habitual es la ruptura en α, que escinde el enlace alquilo contiguo al carbonilo para dar:
1. El correspondiente catión acilio y un radical alquilo.
2. El correspondiente anión acilio y un radical alquilo.
3. El correspondiente radical acilio y un radical alquilo.
4. El correspondiente catión acilio y un catión alquilo.
5. El correspondiente anión acilio y un anión alquilo.

Respuesta correcta: 1. El correspondiente catión acilio y un radical alquilo.